Clinical trial exclusion criterion:
Patients with unstable CAD, assessed by the Cardiology team and defined as new onset angina, rest angina, rapidly increasing or crescendo angina

Annotated entities:
- Condition: "unstable CAD"
- Condition: "new onset angina"
- Condition: "rest angina"
- Condition: "rapidly increasing angina"
- Condition: "crescendo angina"